Clinical trial exclusion criteria:
Preoperative history of schizophrenia, epilepsy, parkinsonism or myasthenia gravis;
Preoperative radio- or chemotherapy;
Inability to communicate in the preoperative period because of coma, profound dementia or language barrier;
Preoperative obstructive sleep apnea (previously diagnosed as obstructive sleep apnea, or a STOP-Bang score >= 3);
Brain trauma or neurosurgery;
Preoperative left ventricular ejection fraction < 30%, sick sinus syndrome, severe sinus bradycardia (< 50 beats per minute), or second-degree or above atrioventricular block without pacemaker;
Severe hepatic dysfunction (Child-Pugh class C) or severe renal dysfunction (requirement of renal replacement therapy before surgery);
ASA classification >= IV.

Annotated entities:
- Condition: "schizophrenia"
- Condition: "epilepsy"
- Condition: "parkinsonism"
- Condition: "myasthenia gravis"
- Temporal: "history"
- Temporal: "Preoperative"
- Procedure: "chemotherapy"
- Procedure: "therapy radio"
- Temporal: "Preoperative"
- Condition: "coma"
- Condition: "dementia"
- Qualifier: "profound"
- Observation: "language barrier"
- Temporal: "preoperative period"
- Condition: "Inability to communicate"
- Condition: "obstructive sleep apnea"
- Temporal: "Preoperative"
- Condition: "obstructive sleep apnea"
- Measurement: "STOP-Bang score"
- Value: ">= 3"
- Condition: "Brain trauma"
- Procedure: "neurosurgery"
- Measurement: "left ventricular ejection fraction"
- Value: "< 30%"
- Temporal: "Preoperative"
- Condition: "sick sinus syndrome"
- Qualifier: "severe"
- Condition: "sinus bradycardia"
- Value: "< 50 beats per minute"
- Condition: "atrioventricular block"
- Negation: "without"
- Device: "pacemaker"
- Qualifier: "second-degree or above"
- Qualifier: "Severe"
- Condition: "hepatic dysfunction"
- Measurement: "Child-Pugh"
- Value: "class C"
- Qualifier: "severe"
- Condition: "renal dysfunction"
- Procedure: "renal replacement therapy"
- Temporal: "before surgery"
- Reference_point: "surgery"
- Procedure: "surgery"
- Measurement: "ASA classification"
- Value: ">= IV"